Known or suspected allergy

The above is a clinical trial exclusion criterion. Annotated with entity spans:
[Mood: Known] or [Mood: suspected] [Condition: allergy]